Clinical trial inclusion criterion:
HBeAg negative within six months prior to initiation of peginterferon alfa-2a

Annotated entities:
- Measurement: "HBeAg"
- Value: "negative"
- Temporal: "within six months prior to initiation of peginterferon alfa-2a"
- Reference_point: "initiation of peginterferon alfa-2a"
- Drug: "peginterferon alfa-2a"